Los pacientes con esquizofrenia suelen presentar el llamado desequilibrio interactivo que se expresa en la conversación con una latencia de respuesta exagerada, habla mínima o falta de participación en la misma ¿Cuál es el método más indicado para evaluar al paciente y decidir si es conveniente realizar un entrenamiento en habilidades sociales?:
1. Mediante escalas de inteligencia.
2. Mediante técnicas de autoinforme: escalas de funcionamiento social.
3. Mediante la medición de la actividad electrodérmica y otras medidas psicofisiológicas.
4. Mediante el ensayo conductual en situaciones simuladas.
5. Mediante cuestionarios e inventarios de rasgos de personalidad.

Respuesta correcta: 4. Mediante el ensayo conductual en situaciones simuladas.